Which was the first approved tumor treatment using a common biomarker rather than specified tumor locations in the body?

The first approved tumor treatment using a common biomarker rather than specified tumor locations in the body was Keytruda, which is a treatment for cancer patients with positive microsatellite instability-high (MSI-H) markers or mismatch repair deficient (dMMR) markers.